人體內T細胞大量分泌那些細胞激素，與引發遲發型（delayed-type）過敏反應的臨床症狀最相關？
A. IL-4 + IL-5
B. IL-5 + IL-17
C. IL-17 + IFN-γ
D. IFN-γ + IL-4

正確答案：C. IL-17 + IFN-γ